Which cells mature in the human thymus?

T cells mature in the human thymus; in particular, type T cells.